Clinical trial exclusion criterion:
any immunosuppressive treatment, such as systemic corticosteroids

Annotated entities:
- Procedure: "immunosuppressive treatment"
- Drug: "systemic corticosteroids"